Secondary causes of osteoarthritis;

The above is a clinical trial exclusion criterion. Annotated with entity spans:
[Undefined_semantics: Secondary causes of osteoarthritis];